組胺酸（histidine）的胺基（- NH2）、側鏈（R-group）與羧基（- COOH）的pKa值分別為 9、6 和 2 ，當此胺基酸處於pH 5.0 的環境中時，溶液中大部分組胺酸分子的帶電狀態應為：
A. 帶二個正電荷
B. 帶一個正電荷
C. 不帶電
D. 帶一個負電荷

正確答案：B. 帶一個正電荷